2. Are pregnant

The above is a clinical trial exclusion criterion. Annotated with entity spans:
2. Are [Condition: pregnant]